Clinical trial inclusion criterion:
Male and female subjects 18-80 years.

Annotated entities:
- Person: "Male"
- Person: "female"
- Person: "years"
- Value: "18-80"